Clinical trial exclusion criterion:
Not requiring significant therapy modification owing to study therapy associated complications

Annotated entities:
- Negation: "Not"
- Procedure: "study therapy"
- Condition: "complications"
- Non-query-able: "Not requiring significant therapy modification owing to study therapy associated complications"